有關人類乳突瘤病毒（Human Papillomavirus, HPV）的敘述，下列何者錯誤？
A. HPV-6和HPV-11是引起子宮頸癌的低危險病毒株
B. E5 病毒蛋白質會與p53結合
C. E7病毒蛋白質會與p105RB蛋白質結合
D. E1蛋白質與病毒的複製有關

正確答案：B. E5 病毒蛋白質會與p53結合